Clinical trial exclusion criterion:
Inability to understand and read English.

Annotated entities:
- Observation: "Inability to understand and read English"